Clinical trial exclusion criterion:
Elevated ALT or serum creatinine on screening or any clinically significant abnormalities on screening laboratory tests as determined by the Investigator.

Entity relations:
- Has_value("ALT", "Elevated")
- Has_index("on screening", "screening")
- Has_value("laboratory tests", "abnormalities")
- AND("abnormalities", "as determined by the Investigator")
- Has_value("serum creatinine", "Elevated")
- Has_temporal("ALT", "on screening")
- Has_temporal("serum creatinine", "on screening")
- OR("ALT", "laboratory tests", "serum creatinine")